Cuál de las siguientes sustancias no encontraremos en un medicamento biotecnológico:
1. Exaltadores de solubilidad.
2. Agentes adsorbentes y agregantes.
3. Componentes de “buffer”.
4. Conservantes y antioxidantes.
5. Agentes osmóticos.

Respuesta correcta: 2. Agentes adsorbentes y agregantes.